Clinical trial inclusion criterion:
HBsAg negative/HBcAb positive/hepatitis B virus DNA negative at baseline

Entity relations:
- Has_value("HBsAg", "negative")
- Has_value("HBcAb", "positive")
- Has_value("hepatitis B virus DNA", "negative")
- Has_temporal("HBsAg", "at baseline")
- Has_temporal("HBcAb", "at baseline")
- Has_temporal("hepatitis B virus DNA", "at baseline")